下列何者為女性骨盆段輸尿管的主要血液供應來源？
A. 卵巢動脈
B. 陰道動脈
C. 子宮動脈
D. 陰部內動脈

正確答案：C. 子宮動脈